ileus

The above is a clinical trial exclusion criterion. Annotated with entity spans:
[Condition: ileus]